List some ways to reverse Tau hyperphosphorylation in Tauopathies?

Different ways have been used to try to reverse Tau hyperphosphorylation through administration of inhibitors such as: 7-nitroindazole,  memantine, glycogen synthase kinase-3 inhibitors. 
Other approaches are transplantation of Human umbilical cord blood-derived mesenchymal stem cells and administration of M1 muscarinic agonists.